Clinical diagnosis of Type 1 diabetes, maturity onset diabetes of the young, secondary diabetes or diabetes insipidus.

The above is a clinical trial exclusion criterion. Annotated with entity spans:
Clinical diagnosis of [Condition: Type 1 diabetes], [Condition: maturity onset diabetes of the young], [Condition: secondary diabetes] or [Condition: diabetes insipidus].